Other diseases/abnormalities: Any life-threatening condition with life expectancy <3 years, other than vascular disease or COPD, that might prevent the subject from completing the study.

The above is a clinical trial exclusion criterion. Annotated with entity spans:
Other diseases/abnormalities: Any [Condition: life-threatening condition] with [Observation: life expectancy] [Value: <3 years], [Negation: other than] [Condition: vascular disease] or [Condition: COPD], [Subjective_judgement: that might prevent the subject from completing the study].